Clinical trial inclusion criterion:
all adult patients with a nasal or facial skin/soft tissue defect requiring reconstruction limited to or including a full-thickness skin graft

Entity relations:
- Has_mood("reconstruction", "requiring")
- AND("nasal skin/soft tissue defect", "reconstruction")
- OR("nasal skin/soft tissue defect", "facial skin/soft tissue defect")